What is caused by heterozygous lamin B1 and lamin B2 variants?

Heterozygous lamin B1 and lamin B2 variants cause primary microcephaly and define a novel laminopathy.